20 歲原本健康男性，昨天開始發燒、寒顫、全身倦怠、頭痛、噁心，今因症狀持續，且有嘔吐而就醫。理學檢查發現皮膚有出血點及出血斑（petechiae and purpuric rash），頸部僵硬。腦脊髓液革蘭氏染色發現有革蘭氏陰性雙球菌（gram-negative diplococci），致病菌為：
A. Streptococcus pneumoniae
B. Klebsiella pneumoniae
C. Neisseria meningitidis
D. Haemophilus influenzae

正確答案：C. Neisseria meningitidis